Clinical trial exclusion criterion:
Excessive alcohol consumption

Annotated entities:
- Condition: "Excessive alcohol consumption"